Clinical trial exclusion criterion:
Patients with uncontrolled congestive heart failure (NYHA Class IV)

Annotated entities:
- Qualifier: "uncontrolled"
- Condition: "congestive heart failure"
- Measurement: "NYHA"
- Value: "Class IV"